Q 型熱（Q fever）是發生在大部分國家的人畜共通傳染病（zoonosis），人被感染後，會呈急性型（肺炎、肝炎、感冒症狀、頭痛）或是嚴重慢性型（心內膜炎）症狀。此疾病是由何種細菌感染所引起？
A. Rickettsia rickettsii
B. Coxiella burnetii
C. Ehrlichia canis
D. Staphylococcus epidermidis

正確答案：B. Coxiella burnetii